最早被核准用於治療愛滋病人的藥物 AZT（Zidovudine）為一核苷酸類似物（nucleoside analog）。其抑制愛滋病毒的機轉為何？
A. 抑制愛滋病毒的去氧核糖核酸聚合酶（DNA polymerase）
B. 抑制愛滋病毒的反轉錄酶（reverse transcriptase）
C. 抑制愛滋病毒的 gag 蛋白
D. 抑制愛滋病毒的 TAT 轉錄因子

正確答案：B. 抑制愛滋病毒的反轉錄酶（reverse transcriptase）